Which algorithm has been developed for finding conserved non-coding elements (CNEs) in genomes?

CNEFinder is a tool for identifying CNEs between two given DNA sequences with user-defined criteria.